Follow-up less than 1 year

The above is a clinical trial exclusion criterion. Annotated with entity spans:
[Measurement: Follow-up] [Temporal: less than 1 year]